Clinical trial inclusion criterion:
1. Patients with histologically confirmed diagnosis of colorectal cancer presenting with unresectable stage IV (UICC) disease (primary tumor may be present)

Entity relations:
- Subsumes("disease", "colorectal cancer")
- Has_qualifier("disease", "stage IV (UICC)")
- Has_qualifier("disease", "unresectable")
- AND("colorectal cancer", "histologically")
- OR("histologically", "confirmed")